小孩患有氣喘，當發作時，須使用吸入性藥物來緩解或控制時，通常不建議使用下列何種藥物，以免影響其生長？
A. β2-agonists
B. corticosteroids
C. leukotrienes antagonists
D. antimuscarinic agents

正確答案：B. corticosteroids